Clinical trial exclusion criterion:
Patients participating in previous, concurrent or not, trials (ongoing or completed within three months);

Entity relations:
- Has_temporal("trials participating in", "previous")
- Has_temporal("completed", "within three months")
- Has_qualifier("trials participating in", "ongoing")
- OR("ongoing", "completed")